3. Intracranial EEG electrodes are being used

The above is a clinical trial exclusion criterion. Annotated with entity spans:
[Parsing_Error: 3.] [Device: Intracranial EEG electrodes] are being used